Clinical trial exclusion criteria:
• Patients without PN during their hospitalization

Annotated entities:
- Negation: "without"
- Procedure: "PN"
- Temporal: "during their hospitalization"
- Procedure: "hospitalization"
- Reference_point: "their hospitalization"